La reducción de nitrilos con hidruro de diisobutil aluminio (DIBAL) proporciona, tras el correspondiente tratamiento ácido acuoso:
1. Aminas.
2. Ácidos.
3. cetonas.
4. Aldehídos.
5. Ninguna de las anteriores.

Respuesta correcta: 4. Aldehídos.